下列有關僵直性脊椎炎（ankylosing spondylitis）之敘述，何者錯誤？
A. 90%以上的病人有 HLA-B27 抗原
B. 80%的病人會併發急性葡萄膜炎（uveitis）
C. 最常侵犯薦腸關節（sacroiliac joint）
D. 脊椎病變的最嚴重併發症為脊椎骨折（spinal fracture）

正確答案：B. 80%的病人會併發急性葡萄膜炎（uveitis）